Clinical trial inclusion criterion:
Women aged above 16 years

Annotated entities:
- Person: "Women"
- Person: "aged"
- Value: "above 16 years"